Histologically confirmed PD-L1 status defined NSCLC. Biopsy must be within 70 days of first treatment with pembrolizumab.

The above is a clinical trial inclusion criterion. Annotated with entity spans:
Histologically confirmed [Qualifier: PD-L1 status] defined [Condition: NSCLC]. [Procedure: Biopsy] must be [Temporal: within 70 days of first treatment] with [Drug: pembrolizumab].